Respecto al adenoma pleomorfo, señale la respuesta correcta:
1. Es un tumor de las glándulas salivales que rara vez recidiva.
2. Afecta predominantemente a la glándula sublingual.
3. Se trata habitualmente mediante parotidectomía conservadora del nervio facial.
4. Se trata habitualmente mediante parotidectomía radical dada la posibilidad de recidiva.

Respuesta correcta: 3. Se trata habitualmente mediante parotidectomía conservadora del nervio facial.